cAMP 是真核細胞（eukaryotic cells）的第二信使（second messenger）之一，可直接調控下列何種蛋白質之功能？
A. 活化 Adenylate cyclase
B. 活化 Protein kinase A
C. 抑制 G protein
D. 抑制 Calmodulin

正確答案：B. 活化 Protein kinase A